47歲男性，右胸部遭槍擊造成血胸合併休克，胸管引流出600 ml 血液後，血壓恢復為122/84 mmHg，脈搏96 次/分，5分鐘後血壓下	為84/62 mmHg，脈搏126次/分，下列何者為最優先的處理步驟？
A. 即執	氣管內管插管
B. 緊急開胸手術
C. 再插另一支胸管
D. 重新評估病人

正確答案：D. 重新評估病人